Clinical trial exclusion criterion:
age less than 40 or over 80 years

Entity relations:
- Has_value("age", "less than 40")
- OR("less than 40", "over 80 years")